Clinical trial exclusion criterion:
Severe renal insufficiency with estimated glomerular filtration rate <30 ml/min/ 1.73 m2

Entity relations:
- Has_value("estimated glomerular filtration rate", "<30 ml/min/ 1.73 m2")
- Has_qualifier("renal insufficiency", "Severe")
- AND("renal insufficiency", "estimated glomerular filtration rate")